Clinical trial inclusion criterion:
Currently taking an antidepressant, mood stabiliser, antipsychotic, anticonvulsant, warfarin or thyroxin, or current regular use (more than 2 days per week) of a benzodiazepine or opioid-based analgesic

Annotated entities:
- Drug: "antidepressant"
- Condition: "taking"
- Temporal: "Currently"
- Drug: "mood stabiliser"
- Drug: "antipsychotic"
- Drug: "anticonvulsant"
- Drug: "warfarin"
- Drug: "thyroxin"
- Drug: "benzodiazepine"
- Drug: "opioid-based analgesic"
- Multiplier: "more than 2 days per week"
- Multiplier: "regular"
- Temporal: "current"
- Procedure: "use"